Clinical trial exclusion criterion:
Fever, elevated white cell count, or other evidence of active infection

Annotated entities:
- Condition: "Fever"
- Measurement: "white cell count"
- Value: "elevated"
- Condition: "active infection"
- Mood: "evidence"